Clinical trial exclusion criterion:
Patient treated with drugs supposed to alter gastric emptying times (calcium antagonists, Alimentary tract treatments, opioid analgesics, tricyclic antidepressants, antibiotics).

Entity relations:
- Subsumes("drugs supposed to alter gastric emptying times", "calcium antagonists")
- OR("calcium antagonists", "Alimentary tract treatments", "opioid analgesics", "tricyclic antidepressants", "antibiotics")